Clinical trial exclusion criterion:
Under the age of 15

Annotated entities:
- Person: "age"
- Value: "Under 15"